Clinical trial exclusion criterion:
History of severe allergic reactions attributed to compounds of similar chemical or biologic composition to rituximab or other agents used in this study.

Annotated entities:
- Condition: "allergic reactions"
- Qualifier: "severe"
- Drug: "compounds of similar chemical or biologic composition to rituximab"
- Drug: "compounds of similar chemical or biologic composition to other agents used in this study"
- Undefined_semantics: "compounds of similar chemical or biologic composition to rituximab or other agents used in this study"